Clinical trial inclusion criterion:
Coagulation disorder defined by PT less than 60%

Entity relations:
- Has_value("PT", "less than 60%")
- Subsumes("Coagulation disorder", "PT")